在非胚胎極（abembryonic pole）處，絨毛膜上的絨毛約於第幾個月退化完全，形成平滑絨毛膜 （chorion laeve）？
A. 3
B. 4
C. 5
D. 6

正確答案：A. 3